Clinical trial exclusion criterion:
Present symptoms of other skin diseases, except chronic atopic dermatitis, that could disturb the study assessment and evaluation of the skin

Entity relations:
- Has_negation("chronic atopic dermatitis", "except")
- Has_qualifier("skin diseases", "could disturb the study assessment and evaluation of the skin")